Clinical trial exclusion criterion:
Death by excessive bleeding (e.g., abdominal main artery rupture);

Entity relations:
- Has_qualifier("main artery rupture", "abdominal")
- Subsumes("Death by excessive bleeding", "main artery rupture")